一般評估環境品質的主要空氣污染物，包括下列那些物質？
A. 臭氧、一氧化碳、懸浮微粒、二氧化硫、二氧化氮
B. 多環芳香碳氫化合物、臭氧、一氧化碳、鉛、苯
C. 甲醛、硫酸氫、石綿、苯、臭味物質
D. 甲苯、二氧化硫、丙烯、一氧化碳、二氧化氮

正確答案：A. 臭氧、一氧化碳、懸浮微粒、二氧化硫、二氧化氮